產程延長，宮口未全開，胎兒頭皮出現水腫鼓起稱為：
A. Molding
B. Caput succedaneum
C. Subdural hematoma
D. Erythema nodosum

正確答案：B. Caput succedaneum